The patients' ECOG scores are =0-2.

The above is a clinical trial inclusion criterion. Annotated with entity spans:
The patients' [Measurement: ECOG scores] are [Value: =0-2].